Clinical trial inclusion criterion:
Autoimmune Hemolytic anemia with clinical and biochemical evidence of hemolysis refractory to treatment, in relapse or steroids dependant

Entity relations:
- multi("refractory to treatment", "treatment")
- multi("steroids dependant", "steroids")
- Has_qualifier("hemolysis", "refractory to treatment")
- Has_qualifier("hemolysis", "in relapse")
- Has_mood("hemolysis", "evidence clinical")
- Has_mood("hemolysis", "biochemical evidence")
- OR("in relapse", "steroids dependant")